If Pregnancy is present

The above is a clinical trial exclusion criterion. Annotated with entity spans:
If [Condition: Pregnancy] is present